Clinical trial exclusion criterion:
Confirmed testosterone < 100 ng/dL

Entity relations:
- Has_value("Confirmed testosterone", "< 100 ng/dL")